有關感染性結石（infection stone）之敘述，下列何者錯誤？
A. 感染性結石最常見的細菌是 Proteus mirabilis
B. 最好的治療方式是手術移除結石
C. 單純使用抗生素治療無效的主要原因是結石中的細菌產生抗藥性
D. 給予預防性抗生素可以降低結石及感染的復發

正確答案：C. 單純使用抗生素治療無效的主要原因是結石中的細菌產生抗藥性